Clinical trial exclusion criterion:
chronic otitis

Annotated entities:
- Condition: "chronic otitis"